Clinical trial exclusion criterion:
Subject with a history of loss of vision because of non-arteritic anterior ischemic optic neuropathy (NAION), history of temporary or permanent loss of vision, including unilateral loss of vision

Entity relations:
- Subsumes("non-arteritic anterior ischemic optic neuropathy", "NAION")
- AND("loss of vision", "non-arteritic anterior ischemic optic neuropathy")
- Has_qualifier("loss of vision", "temporary")
- Has_qualifier("loss of vision", "unilateral")
- Subsumes("loss of vision", "loss of vision")
- Has_temporal("loss of vision", "history of")
- OR("temporary", "permanent")
- OR("loss of vision", "loss of vision")